Patients with hepatocirrhosis: according to the standard of child- pugh, liver functions to achieve class A or B patients, Including C class patients but can achieve B class after treatment

The above is a clinical trial inclusion criterion. Annotated with entity spans:
Patients with [Condition: hepatocirrhosis]: according to the standard of child- pugh, liver functions to achieve class A or B patients, Including C class patients but can achieve B class after treatment